chronic diarrhea, any clinical signs of volume depletion or a hematocrit > 48 % (women) and > 53 % (men)

The above is a clinical trial exclusion criterion. Annotated with entity spans:
[Condition: chronic diarrhea], any clinical signs of [Condition: volume depletion] or a [Measurement: hematocrit] [Value: > 48 %] ([Person: women]) and [Value: > 53 %] ([Person: men])